Clinical trial exclusion criterion:
History of panic disorder, psychosis, bipolar disorder, or eating disorders

Annotated entities:
- Condition: "panic disorder"
- Condition: "psychosis"
- Condition: "bipolar disorder"
- Condition: "eating disorders"